Clinical trial inclusion criterion:
Histologically or cytologically confirmed diagnosis of adenocarcinoma of the colon or rectum.

Annotated entities:
- Procedure: "Histologically"
- Procedure: "cytologically"
- Value: "confirmed"
- Condition: "adenocarcinoma"
- Qualifier: "colon"
- Qualifier: "rectum"